大腸桿菌DNA聚合酶I型（DNA polymerase I）的何種酵素活性會參與執行nick translation？
A. 聚合酶與5'核酸外切酶（polymerase and 5'→3'exonuclease）
B. 聚合酶與3'核酸外切酶（polymerase and 3'→5'exonuclease）
C. 5'與3'核酸外切酶（5'→3' and 3'→5'exonuclease）
D. 聚合酶，5'與3'核酸外切酶（polymerase, 5'→3' and 3'→5'exonuclease）

正確答案：A. 聚合酶與5'核酸外切酶（polymerase and 5'→3'exonuclease）